血紅蛋白（Hemoglobin）其構形由 T 轉變成 R 型是由於結合了下列那些物質所引起？
A. 氧氣（O2）
B. 三價鐵（Fe3+）
C. 次單元之結合（subunit association）
D. 次單元之解離（subunit dissociation）

正確答案：A. 氧氣（O2）